Clinical trial exclusion criterion:
Age less than 14 years

Annotated entities:
- Person: "Age"
- Value: "less than 14 years"